Clinical trial inclusion criterion:
Evidence or suspicion of upper gastrointestinal bleed (GIB)

Annotated entities:
- Mood: "suspicion"
- Mood: "Evidence"
- Condition: "upper gastrointestinal bleed (GIB)"